Serum aspartate transaminase > 3 times upper limit of normal

The above is a clinical trial exclusion criterion. Annotated with entity spans:
[Measurement: Serum aspartate transaminase] [Value: > 3 times upper limit of normal]